Clinical trial exclusion criterion:
hypersensitivity to perindopril or to other ACE inhibitors, amlodipine, atorvastatin, dihydropyridines or to or statins

Annotated entities:
- Condition: "hypersensitivity"
- Drug: "perindopril"
- Drug: "ACE inhibitors"
- Drug: "amlodipine"
- Drug: "atorvastatin"
- Drug: "dihydropyridines"
- Drug: "statins"
- Qualifier: "other"